2. Screening tools: SCID Screen Patient Questionnaire. Potential diagnoses will be further evaluated by a counsellor.

The above is a clinical trial exclusion criterion. Annotated with entity spans:
[Parsing_Error: 2.] [Not_a_criteria: Screening tools: SCID Screen Patient Questionnaire.] [Not_a_criteria: Potential diagnoses will be further evaluated by a counsellor.]